Hombre de 52 años que acude al servicio de Urgencias por cefalea y fiebre (37,8ºC) de 2 días de evolución. En las últimas horas asocia además dificultad para la nominación y comprensión. En la exploración realizada no se observa rigidez de nuca siendo lo más llamativo la presencia de una afasia mixta. El fondo de ojo es normal. La TC craneal muestra una tenue hipodensidad en lóbulo temporal izquierdo sin efecto de masa y sin captación de contraste. ¿Cuál de las siguientes afirmaciones es la correcta?:
1. Una meningitis bacteriana es la primera impresión diagnóstica y hay que iniciar cuanto antes tratamiento con cefalosporina de 3ª generación.
2. Lo más probable es que el LCR de este paciente nos muestre una pleocitosis de predominio linfocitario con glucorraquia normal.
3. Sospecharíamos una encefalitis límbica.
4. Se trata de un absceso cerebral en fase inicial.

Respuesta correcta: 2. Lo más probable es que el LCR de este paciente nos muestre una pleocitosis de predominio linfocitario con glucorraquia normal.